Clinical trial exclusion criterion:
Patients who are anticipated to receive treatment or surgery that may require desisting the administration of antiplatelet therapy for 2 weeks or longer during the period of the clinical trial

Annotated entities:
- Mood: "anticipated to"
- Procedure: "treatment"
- Procedure: "surgery"
- Procedure: "antiplatelet therapy"
- Temporal: "for 2 weeks or longer"